Clinical trial inclusion criteria:
1. Women and men ages 18 years and over.
2. Interest in participating in a novel nutritional supplement program.
3. Willingness to follow recommendations.

Annotated entities:
- Person: "Women"
- Person: "men"
- Person: "ages"
- Value: "18 years and over"
- Grammar_Error: "and"
- Post-eligibility: "Interest in participating in a novel nutritional supplement program."
- Post-eligibility: "Willingness to follow recommendations."